Mandan proyecciones eferentes desde la corteza cerebelosa las:
1. Células de Purkinge.
2. Fibras trepadoras.
3. Células granulosas.
4. Células horizontales.
5. Fibras musgosas.

Respuesta correcta: 1. Células de Purkinge.